Clinical trial inclusion criterion:
Male or female on stable dose of IgPro20 (Hizentra) therapy.

Annotated entities:
- Person: "Male"
- Person: "female"
- Drug: "IgPro20"
- Drug: "Hizentra"
- Qualifier: "stable dose"